Failed previous fusion

The above is a clinical trial inclusion criterion. Annotated with entity spans:
[Qualifier: Failed] [Temporal: previous] [Procedure: fusion]